一位56歲無特殊病史男性，亦無任何不適，在一次健康檢查時發現血紅素為13.5 gm/dL，白血球11500/µL，血小板875000/µL；理學檢查無特殊異常。下列何項抽血檢 的結果可確定診斷此病人為原發性血小板增多症（essential thrombocythemia）而非次發性？
A. low thrombopoietin level
B. increased LAP score
C. JAK2 mutation
D. immature myeloid cells

正確答案：C. JAK2 mutation